What is the role of Adamts18 in hormone receptor signaling?

Adamts18 links luminal hormone receptor signaling to basement membrane remodeling and stem cell activation.